History of life threatening asthma: Defined as an asthma episode that required intubation and/or was associated with hypercapnea, respiratory arrest or hypoxic seizures within the last 6 months.

The above is a clinical trial exclusion criterion. Annotated with entity spans:
History of [Qualifier: life threatening] [Condition: asthma]: Defined as an [Condition: asthma episode] that [Qualifier: required intubation] and/or was associated with [Condition: hypercapnea], [Condition: respiratory arrest] or [Condition: hypoxic seizures] [Temporal: within the last 6 months].